Clinical trial exclusion criterion:
Has planned release from the Canadian Armed Forces within one year;

Annotated entities:
- Observation: "release from the Canadian Armed Forces"
- Temporal: "within one year"